Clinical trial inclusion criterion:
Mayo score (including sigmoidoscopy unless performed in previous 3 months)

Entity relations:
- Subsumes("Mayo score", "sigmoidoscopy")